Which drugs are included in GI cocktail?

"GI cocktail" is a mixture of liquid antacid, viscous lidocaine, and an anticholinergic.